patients previously included in this study (for patients who have second intra-abdominal surgery during the study period).

The above is a clinical trial exclusion criterion. Annotated with entity spans:
[Non-query-able: patients previously included in this study (for patients who have second intra-abdominal surgery during the study period).]